Clinical trial exclusion criteria:
Patients with symptomatic CNS metastases or leptomeningeal involvement
Patients with known brain metastases, unless these metastases have been treated and/or have been stable for at least six months prior to study start. Subjects with a history of brain metastases must have a head CT with contrast to document either response or progression.
Patients with bone metastases as the only site(s) of measurable disease
Patients with hepatic artery chemoembolization within the last 6 months (one month if there are other sites of measurable disease)
Patients who have been previously treated with radioactive directed therapies
Patients who have been previously treated with epothilone
Patients with any peripheral neuropathy or unresolved diarrhea greater than Grade 1
Patients with severe cardiac insufficiency patients taking Coumadin or other warfarin-containing agents with the exception of low dose warfarin (1 mg or less) for the maintenance of in-dwelling lines or ports
Patients taking any experimental therapies history of another malignancy within 5 years prior to study entry except curatively treated non-melanoma skin cancer, prostate cancer, or cervical cancer in situ
Patients with active or suspected acute or chronic uncontrolled infection including abcesses or fistulae
Patients with a medical or psychiatric illness that would preclude study or informed consent and/or history of noncompliance to medical regimens or inability or unwillingness to return for all scheduled visits
HIV+ patients
Pregnant or lactating females.

Annotated entities:
- Condition: "CNS metastases"
- Condition: "leptomeningeal involvement"
- Qualifier: "symptomatic"
- Procedure: "treated"
- Qualifier: "been stable for"
- Temporal: "at least six months prior to study start"
- Condition: "brain metastases"
- Temporal: "history of"
- Condition: "brain metastases"
- Procedure: "head CT with contrast"
- Negation: "unless"
- Condition: "bone metastases"
- Multiplier: "only site(s) of measurable disease"
- Procedure: "hepatic artery chemoembolization"
- Temporal: "within the last 6 months"
- Temporal: "one month"
- Observation: "other sites of measurable disease"
- Procedure: "radioactive directed therapies"
- Temporal: "previously"
- Drug: "epothilone"
- Temporal: "previously"
- Condition: "peripheral neuropathy"
- Condition: "unresolved diarrhea"
- Measurement: "Grade"
- Value: "greater than 1"
- Condition: "severe cardiac insufficiency"
- Drug: "Coumadin"
- Drug: "warfarin-containing agents"
- Qualifier: "low dose"
- Drug: "warfarin"
- Multiplier: "1 mg or less"
- Device: "in-dwelling lines"
- Device: "in-dwelling ports"
- Negation: "with the exception of"
- Condition: "another malignancy"
- Temporal: "within 5 years prior to study entry"
- Condition: "non-melanoma skin cancer"
- Qualifier: "curatively treated"
- Condition: "prostate cancer"
- Condition: "cervical cancer in situ"
- Temporal: "history of"
- Negation: "except"
- Non-representable: "Patients taking any experimental therapies"
- Condition: "uncontrolled infection"
- Condition: "abcesses"
- Condition: "fistulae"
- Qualifier: "active"
- Qualifier: "suspected"
- Qualifier: "acute"
- Qualifier: "chronic"
- Condition: "psychiatric illness"
- Condition: "medical illness"
- Observation: "preclude study"
- Observation: "informed consent"
- Observation: "noncompliance to medical regimens"
- Mood: "inability to return for all scheduled visits"
- Mood: "unwillingness to return for all scheduled visit"
- Condition: "HIV+"
- Measurement: "HIV"
- Value: "+"
- Condition: "Pregnant"
- Condition: "lactating"